9. Baseline creatinine >20% above the upper limit of normal for age

The above is a clinical trial exclusion criterion. Annotated with entity spans:
9. [Temporal: Baseline] [Measurement: creatinine] [Value: >20% above the upper limit of normal for age]